陰部神經（pudendal nerve）受損對下列何者的影響最小？
A. 尿道
B. 子宮
C. 陰道
D. 肛管

正確答案：B. 子宮